性行為活躍之年輕男性罹患尿道炎，由尿道流出之膿液在顯微鏡檢查觀察，有細胞內格蘭氏陰性雙球菌，其尿道炎之致病菌是：
A. Streptococcus pneumoniae
B. Nesseria gonorrhoeae
C. Nesseria meningitidis
D. Mycoplasma genitalium

正確答案：B. Nesseria gonorrhoeae